Clinical trial exclusion criterion:
Known or suspected contraindications to the study medications, including history of allergy to Angiotensin converting enzyme (ACE) inhibitors and/or to thiazide diuretics or other sulfonamide derived drug

Entity relations:
- AND("allergy", "Angiotensin converting enzyme (ACE) inhibitors")
- AND("contraindications", "study medications")
- Subsumes("contraindications", "allergy")
- Has_temporal("allergy", "history of")
- Has_qualifier("sulfonamide derived drug", "other")
- OR("Angiotensin converting enzyme (ACE) inhibitors", "thiazide diuretics", "sulfonamide derived drug")